Clinical trial inclusion criterion:
Women who are pre-menopausal must have a negative serum pregnancy test

Annotated entities:
- Person: "Women"
- Condition: "pre-menopausal"
- Measurement: "serum pregnancy test"
- Value: "negative"